Clinical trial exclusion criterion:
Uncontrolled and ongoing psychiatric diseases;

Entity relations:
- Has_temporal("psychiatric diseases", "ongoing")
- Has_qualifier("psychiatric diseases", "Uncontrolled")